Clinical trial exclusion criterion:
Vaccination within 30 days prior to the first dose administration or has plans to receive a vaccination during the course of the study (including the follow phone call on Day 105).

Annotated entities:
- Procedure: "Vaccination"
- Temporal: "within 30 days prior"
- Reference_point: "the first dose administration"
- Mood: "plans"
- Non-query-able: "plans"
- Procedure: "vaccination"
- Temporal: "during the course"
- Reference_point: "study"